age between 18-80 years old

The above is a clinical trial inclusion criterion. Annotated with entity spans:
[Person: age] [Value: between 18-80 years] old